El sistema de Baltimore de clasificación de virus se basa en:
1. El tipo de material genético (DNA o RNA) que poseen.
2. La morfología de sus viriones.
3. La replicación del genoma y el proceso de síntesis de su mRNA.
4. La simetría de la cápside.
5. La presencia o ausencia de envoltura.

Respuesta correcta: 3. La replicación del genoma y el proceso de síntesis de su mRNA.